Clinical trial exclusion criterion:
Any abnormality of the cornea which may prevent reliable applanation tonometry

Annotated entities:
- Condition: "abnormality"
- Qualifier: "cornea"